Clinical trial exclusion criterion:
Subject is pregnant or interested in becoming pregnant in the next two (2) years.

Entity relations:
- Has_mood("pregnant", "interested in becoming")
- Has_temporal("pregnant", "in the next two (2) years")
- OR("pregnant", "pregnant")